Allograft functioning at an acceptable level as defined by the AST, ALT, Total Bilirubin levels =3 times ULN prior to enrollment.

The above is a clinical trial inclusion criterion. Annotated with entity spans:
[Measurement: Allograft functioning] at an [Value: acceptable level] as defined by the [Measurement: AST], [Measurement: ALT], [Measurement: Total Bilirubin] levels [Value: =3 times ULN] [Temporal: prior to enrollment].